Clinical trial exclusion criterion:
no female subject of childbearing potential without use of effective nonhormonal birth control methods, or not willing to continue practicing these birth control methods for at least 30 days after the end of the treatment period

Annotated entities:
- Person: "female"
- Condition: "childbearing potential"
- Negation: "without"
- Qualifier: "effective"
- Procedure: "nonhormonal birth control"
- Negation: "not"
- Mood: "willing to continue practicing"
- Procedure: "birth control methods"
- Temporal: "for at least 30 days after the end of the treatment period"
- Reference_point: "the end of the treatment period"